Clinical trial inclusion criterion:
TBUT > 5 sec. and < 10 sec.

Entity relations:
- Has_value("TBUT", "> 5 sec. and < 10 sec")